40歲男性有高血壓、慢性腎病，有時精神倦怠，血中肌酸酐（creatinine）6.5 mg/dL、血色素11.6 g/dL、鐵素 （ferritin）105 ng/mL、維生素B12 150 pg/mL、葉酸（folate）1.2 ng/mL。對此病人，使用下列何者治療最不適當？
A. 紅血球生長素
B. 鐵劑
C. 維生素B12
D. 葉酸

正確答案：A. 紅血球生長素